Clinical trial exclusion criterion:
uncontrolled hypertension

Annotated entities:
- Qualifier: "uncontrolled"
- Condition: "hypertension"